Use of hormone replacement therapy or hormonal contraceptive agents within days prior to surgery

The above is a clinical trial exclusion criterion. Annotated with entity spans:
Use of [Procedure: hormone replacement therapy] or [Drug: hormonal contraceptive agents] [Temporal: within days prior to surgery]